有關 urea recycling 之敘述，下列何者錯誤？
A. urea recycling 的現象對 liver failure 之病人有利
B. 人類本身無法製造 urease
C. 長期食用低蛋白高纖維食物的人，其 urea recycling 較多
D. 大腸內細菌可發揮 urea recycling 之作用

正確答案：A. urea recycling 的現象對 liver failure 之病人有利